9. Patient or parent/guardian capable of providing informed consent.

The above is a clinical trial inclusion criterion. Annotated with entity spans:
[Parsing_Error: 9.] [Non-query-able: Patient or parent/guardian capable of providing informed consent.]